有一兒童出生後即有腹脹現象，便秘與腹瀉經常交替出現，外觀看來有營養不良的情形。理學檢查發現肛門較緊，但外觀正常。下列何種檢查對診斷幫忙不大？
A. 肛門鏡（Anoscopy）
B. 鋇劑灌腸（Barium enema）
C. 肛門直腸壓力測驗（Anorectal manometry）
D. 直腸切片（Rectal biopsy）

正確答案：A. 肛門鏡（Anoscopy）